Clinical trial inclusion criterion:
Primary diagnosis other than GAD

Annotated entities:
- Condition: "GAD"
- Condition: "Primary diagnosis"
- Negation: "other than"